一位 50 歲女性，已知為 B 型及 C 型肝炎帶原者 10 年，肝功能檢查一向正常，最近半年 GOT 值及 GPT 值都維持 100 U/L 左右（兩項正常值均為 0-35 U/L），為了解 B 型及 C 型肝炎是否發作，安排下列何者定量檢驗是最恰當的？（HBV 指 B 型肝炎病毒，HCV 指 C 型肝炎病毒。）
A. HBV DNA 及 HCV DNA
B. HBV DNA 及 HCV RNA
C. HBV RNA 及 HCV DNA
D. HBV RNA 及 HCV RNA

正確答案：B. HBV DNA 及 HCV RNA